Clinical trial exclusion criterion:
Active bleeding, bleeding diathesis.

Annotated entities:
- Condition: "bleeding"
- Condition: "bleeding diathesis"
- Qualifier: "Active"